Clinical trial exclusion criterion:
Expected life-span less than <1 year

Entity relations:
- Has_value("Expected life-span", "less than <1 year")